Clinical trial inclusion criterion:
18-45 years

Annotated entities:
- Value: "18-45"
- Person: "years"